Clinical trial exclusion criterion:
any wound or infection related to puncture site

Annotated entities:
- Condition: "wound"
- Condition: "infection"
- Qualifier: "puncture site"